28歲女性病患，主訴每天醒來沒有異狀，經過一段時間漸漸產生眼皮下垂及複視現象，以上症狀經過休息會獲得改善，下列那種檢查最能幫助病人確認診斷？
A. 神經傳導測試（nerve conduction studies）
B. 肌電圖檢查（electromyogram）
C. 重複性電擊刺激（repetitive stimulation test）
D. 瞬眼反射檢查（blink reflex）

正確答案：C. 重複性電擊刺激（repetitive stimulation test）